Which two drugs are included in the MAVYRET pill?

MAVYRET pill includes glecaprevir and pibrentasvir. It is used for treatment of hepatitis C infection.